下列有關著色性乾皮症（xeroderma pigmentosum）的敘述，何者錯誤？
A. 是一種遺傳性疾病
B. 病患對紫外光（ultraviolet）敏感，容易產生皮膚癌
C. 部分病患伴隨神經異常（neurological abnormalities）
D. 因為缺乏鹼基切除修復（base excision-repair）功能

正確答案：D. 因為缺乏鹼基切除修復（base excision-repair）功能